一位 34 歲男性病患至骨科門診就醫，病人職業為搬家工人，最近半年來即有下背痛的現象，嚴重時會影響工作；主訴近半個月來從右臀部延伸至同側小腿及第一腳趾劇烈麻痛，嚴重跛行，咳嗽及上廁所用力時會加重其症狀。回顧其病史，在出現右下肢麻痛的前一天，有背太重物品腰閃到的感覺，因此我們判斷該病患最可能的診斷為下列何者？
A. 脊椎管狹窄（spinal stenosis）
B. 脊椎滑脫（spondylolisthesis）
C. 椎間盤突出（HIVD）
D. 惡性腫瘤轉移

正確答案：C. 椎間盤突出（HIVD）